子宮頸口（uterine external os）的上皮組織屬於下列何者？
A. 單層柱狀上皮組織（simple columnar epithelium）
B. 未角質化複層扁平上皮組織（nonkeratinized stratified squamous epithelium）
C. 移形上皮細胞（transitional epithelium）
D. 單層立方上皮組織（simple cuboidal epithelium）

正確答案：B. 未角質化複層扁平上皮組織（nonkeratinized stratified squamous epithelium）